Clinical trial exclusion criterion:
History of severe allergic reactions attributed to compounds of similar chemical or biologic composition to rituximab or other agents used in this study.

Entity relations:
- Has_qualifier("allergic reactions", "severe")
- AND("allergic reactions", "compounds of similar chemical or biologic composition to rituximab")
- OR("compounds of similar chemical or biologic composition to rituximab", "compounds of similar chemical or biologic composition to other agents used in this study")